有關 nonclostridial necrotizing fasciitis 的敘述，下列何者最不妥？
A. 常見皮膚紅腫
B. 常見皮下滲出液呈現膿液狀
C. 常見皮下肌肉壞死
D. 表皮可能呈現水泡或有氣泡壓聲

正確答案：C. 常見皮下肌肉壞死